Patients with motor fluctuations

The above is a clinical trial inclusion criterion. Annotated with entity spans:
Patients with [Condition: motor fluctuations]